Clinical trial exclusion criterion:
Patients <65 years of age

Annotated entities:
- Value: "<65 years"
- Person: "age"